Clinical trial inclusion criterion:
Inpatient or outpatient age 8-19 years inclusive; participants must live with a parent, guardian, or caregiver;

Annotated entities:
- Person: "Inpatient"
- Person: "outpatient"
- Person: "age"
- Value: "8-19 years"
- Non-query-able: "participants must live with a parent, guardian, or caregiver"